Clinical trial inclusion criterion:
Age 18-64 Enrollment will be limited to adults younger than 65 years because of the increased risk of adverse medication effects in the elderly.

Annotated entities:
- Person: "Age"
- Value: "18-64"
- Person: "adults"
- Value: "younger than 65 years"
- Condition: "adverse effects"
- Drug: "medication"
- Person: "elderly"
- Mood: "increased risk"